¿Qué músculo tiene su origen en el arco cigomático y su inserción en la superficie externa de la mandíbula?:
1. Cigomático Mayor.
2. Bucinador.
3. Temporal.
4. Masetero.

Respuesta correcta: 4. Masetero.